8 歲男童主訴自 1 週前開始有紅棕色尿。兩週前他有輕微的上呼吸道感染，但是過去兩週當中他沒有發燒、咳嗽、腹痛或腰痛的症狀。實驗室檢查發現他有輕微貧血（血色素值 10.5 g/dL）。尿液常規檢查顯示 Occult blood 強陽性(4+)；Protein >300 mg/dL; WBC 50-100/HPF; RBC 100-150/HPF。血中 C3 補體下降、C4 正常。下列何者為最可能之診斷？
A. B 型肝炎相關之膜性腎病變（hepatitis B associated membranous nephropathy）
B. IgA 腎炎（IgA nephropathy）
C. 泌尿道感染（urinary tract infection）
D. 鏈球菌感染後之急性腎炎（poststreptococcal glomerulonephritis）

正確答案：D. 鏈球菌感染後之急性腎炎（poststreptococcal glomerulonephritis）